¿Cuál es el curso más frecuente del trastorno de somatización (DSM-IV-TR)?
1. Es una enfermedad aguda.
2. Es una enfermedad crónica que siempre remite de manera completa.
3. Es una enfermedad crónica y fluctuante que pocas veces remite de forma completa.
4. Es muy frecuente que pase un año y el individuo que padece este trastorno ya no busque ayuda médica por síntomas somáticos inexplicables.
5. No es una enfermedad fluctuante pero no se considera crónica.

Respuesta correcta: 3. Es una enfermedad crónica y fluctuante que pocas veces remite de forma completa.